Patients volunteered for the study and signed informed consent.

The above is a clinical trial inclusion criterion. Annotated with entity spans:
[Informed_consent: Patients volunteered for the study and signed informed consent.]